我國的社會福利制度中，頸髓損傷造成四肢完全癱瘓的殘障者可以申請相關福利，何者不包括在內？
A. 免繳健保費
B. 向健保局申請殘廢補助
C. 申請重大傷病卡免繳部分負擔
D. 申請殘障手冊，請領生活補助費

正確答案：B. 向健保局申請殘廢補助